黃先生，60歲，經腹部電腦斷層、腹部血管攝影及肝臟切片檢查後確診為肝癌，下列敘述何者錯誤？
A. 手術切除對於小於5公分之單發性肝癌，是一種根除性（curative）的治療方法
B. 肝腫瘤電燒治療對於小於3公分之單發性肝癌，治療成效良好
C. 對於多發性肝癌，栓塞治療（trans-arterial embolization therapy, TAE）只會增加病患死亡率，不宜考慮
D. 肝癌術後追蹤應包括腹部超音波及血中甲種胎兒蛋白（α-fetoprotein）檢查

正確答案：C. 對於多發性肝癌，栓塞治療（trans-arterial embolization therapy, TAE）只會增加病患死亡率，不宜考慮